Patients with a body weight < 55 kg (known or estimated)

The above is a clinical trial exclusion criterion. Annotated with entity spans:
Patients with a [Measurement: body weight] [Value: < 55 kg] (known or estimated)